優勢大腦半球的角迴（angular gyrus）和緣上迴（supramarginal gyrus）損傷會造成：
A. 接收性失語症（Receptive aphasia）
B. 空間辨識障礙
C. 輕微失聰
D. 眼球偏向損傷側

正確答案：A. 接收性失語症（Receptive aphasia）